Clinical trial inclusion criteria:
Signed informed consent form
Male or female of aged 50 years or older
Typical AMD and PCV patients
BCVA of 24 letters or over

Annotated entities:
- Informed_consent: "Signed informed consent form"
- Person: "Male"
- Person: "female"
- Person: "aged"
- Value: "50 years or older"
- Condition: "PCV patients"
- Condition: "AMD"
- Condition: "BCVA"
- Qualifier: "24 letters or over"